陳同學就讀國中三年級，上體育課練習棒球接傳時，不慎被硬式棒球擊中左臉部，兩天後因持續腫脹、疼痛至門診就診，理學檢查發現：雙眼看左上方時，一個物體會出現兩個影像；左側面頰與左上唇感覺變得麻木；嘴巴沒有辦法像受傷前張開得那麼大；上下排牙齒咬合的位置與原來沒有差別。 請問下列那一個診斷最適當？
A. 左側顴骨骨折
B. 左側顴骨弓骨折
C. 左側下顎骨骨折
D. 左側上顎骨骨折

正確答案：A. 左側顴骨骨折